Para hacer un diagnóstico de Trastorno de Pánico según DSM (DSM-IV-TR y DSM-5) ¿Cuál de los siguientes aspectos es imprescindible?:
1. Que se hayan dado al menos tres ataques de pánico.
2. Que los ataques de pánico hayan dado lugar a respuestas de evitación.
3. Que los ataques de pánico se acompañen de una alta hipervigilancia a las sensaciones físicas.
4. Que se hayan descartado causas biológicas (i.e. uso de sustancias o condición médica general) de los síntomas.

Respuesta correcta: 4. Que se hayan descartado causas biológicas (i.e. uso de sustancias o condición médica general) de los síntomas.